Clinical trial exclusion criterion:
Recipient < 14years of age

Entity relations:
- Has_value("age", "< 14years")